Clinical trial exclusion criterion:
Serious comorbidities preventing prescription of paracetamol

Annotated entities:
- Qualifier: "Serious"
- Condition: "comorbidities"
- Condition: "preventing"
- Drug: "paracetamol"